25 歲男性，因車禍意外造成左大腿骨折，經石膏固定治療，幾週來左腿無法自由行動，發現他左腿變細。下列何者最能解釋肌肉的變化？
A. 細胞凋亡（apoptosis）
B. 萎縮（atrophy）
C. 發育不良（hypoplasia）
D. 營養不良（dystrophy）

正確答案：B. 萎縮（atrophy）